Cough

The above is a clinical trial inclusion criterion. Annotated with entity spans:
[Condition: Cough]